Non-smokers (never smoked or not smoking for >6 months with <10 pack years history (Pack years = [cigarettes per day smoked/20] multiplied by number of years smoked).

The above is a clinical trial inclusion criterion. Annotated with entity spans:
[Observation: Non-smokers] ([Observation: never smoked] or [Observation: not smoking] [Temporal: for >6 months] with [Value: <10] [Measurement: pack years] history ([Non-representable: Pack years = [cigarettes per day smoked/20] multiplied by number of years smoked]).